Type B natriuretic peptide (BNP) >150 pg/ml (or pro-BNP [N-terminal-proBNP] = 600 pg / ml) or if the patient was hospitalized for cardiac decompensation within the preceding 12 months, BNP >100 pg/ml (or N-terminal-proBNP = 400 pg / ml)

The above is a clinical trial inclusion criterion. Annotated with entity spans:
[Measurement: Type B natriuretic peptide (BNP)] [Value: >150 pg/ml] (or [Measurement: pro-BNP [N-terminal-proBNP]] [Value: = 600 pg / ml]) or if the patient was [Procedure: hospitalized] for [Condition: cardiac decompensation] [Temporal: within the preceding 12 months], [Measurement: BNP] [Value: >100 pg/ml] (or [Measurement: N-terminal-proBNP] [Value: = 400 pg / ml])